Heart rate <60 beats/min

The above is a clinical trial exclusion criterion. Annotated with entity spans:
[Measurement: Heart rate] [Value: <60 beats/min]